Clinical trial exclusion criterion:
Exacerbation of chronic diseases;

Entity relations:
- AND("Exacerbation", "chronic diseases")